Documented history of liver or kidney problems

The above is a clinical trial exclusion criterion. Annotated with entity spans:
Documented [Temporal: history] of [Condition: liver] or [Condition: kidney problems]